List fluorescent reporter proteins.

Fluorescent and luminescent reporter genes have become popular tools for the real-time monitoring of gene expression in living cells:
green fluorescent protein
Timer
red fluorescent protein
yellow fluorescent protein
beta-phycoerythrin
coral fluorescent reporter protein
enhanced green fluorescent reporter protein
mCherry